11. Patients with severe rheumatoid arthritis (with more than 20 persistently inflamed joints, or below lower normal limit blood albumin level, or evidence of bone and cartilage damage on x-ray, or inflammation in tissues other than joints) and other collagen vascular diseases.

The above is a clinical trial exclusion criterion. Annotated with entity spans:
[Parsing_Error: 11.] Patients with [Qualifier: severe] [Condition: rheumatoid arthritis] (with [Multiplier: more than 20] [Temporal: persistently] [Condition: inflamed joints], or [Value: below lower normal limit] [Measurement: blood albumin level], or evidence of [Condition: bone and cartilage damage] on [Procedure: x-ray], or [Condition: inflammation in tissues other than joints]) and other [Condition: collagen vascular diseases].